下列關於燒燙傷深度（burn depths）的判斷，下列敘述何者錯誤？
A. 國中生到海水浴場玩，被太陽曬傷造成背部發紅及疼痛。發紅的皮膚受到壓迫會變白（blanch to the touch），壓力釋放後又變紅。這是一度燒燙傷
B. 老人家燒熱水洗澡。水太熱又忘了加冷水。一腳踏進浴缸的熱水裡被燙傷。患處皮膚蒼白、起水泡、受到壓迫不變色（do not blanch to touch），但是碰觸尖細物品仍會疼痛（painful to pinprick）。這是淺二度燒燙傷
C. 機車騎士出車禍。小腿遠端內側被灼熱的排氣管壓住造成灼傷。患處皮膚形成不痛的皮革狀焦痂（leathery eschar），這是
D. 情侶分手，女方極度沮喪而燒炭自殺。女方昏迷後被發現，送醫成功挽回生命。但患者在燒炭昏迷的過程中，右腳太靠近炭火，連肌肉都被烤焦了。這是四度燒燙傷

正確答案：B. 老人家燒熱水洗澡。水太熱又忘了加冷水。一腳踏進浴缸的熱水裡被燙傷。患處皮膚蒼白、起水泡、受到壓迫不變色（do not blanch to touch），但是碰觸尖細物品仍會疼痛（painful to pinprick）。這是淺二度燒燙傷